Según las recomendaciones de la Guía del 2010 del Consejo Español de Resucitación Cardiopulmonar, al aplicar las maniobras de reanimación cardiopulmonar en un lactante se debe:
1. Realizar el masaje cardiaco con ambas manos.
2. Lograr que el tórax descienda entre 5 y 8 cm en cada compresión.
3. Insuflar toda la cantidad de aire posible al realizar la ventilación boca a boca.
4. Mantener una frecuencia de masaje cardiaco en torno a 200 latidos por minuto.
5. Utilizar una relación de compresiones y ventilaciones 15:2.

Respuesta correcta: 5. Utilizar una relación de compresiones y ventilaciones 15:2.